Which is the main difference in the roles of Otx2 and Nanog during development?

Antagonism between the transcription factors NANOG and OTX2 specifies rostral or caudal cell fate during neural patterning transition . The transcription factor Otx2 acts as a negative switch in the regulation of transition from naive to primed pluripotency in mouse pluripotent stem cells . OTX2-mediated Nanog regulation contributes to the integrity of the ESC state and cell lineage specification in preimplantation development .